Clinical trial exclusion criterion:
Severe daytime sleepiness (Epworth sleepiness scale >18)

Annotated entities:
- Qualifier: "Severe"
- Condition: "daytime sleepiness"
- Measurement: "Epworth sleepiness scale"
- Value: ">18"